Inability to communicate or cooperate with the investigators

The above is a clinical trial exclusion criterion. Annotated with entity spans:
[Post-eligibility: Inability to communicate or cooperate with the investigators]